下列何者是編碼子（codon）與反編碼子（anticodon）配對時，擺動假說（wobble hypothesis）的最佳詮釋？
A. 指每一tRNA都只能辨認一個特定的編碼子
B. 指某些tRNA能辨認不同胺基酸的各種編碼子
C. 指反編碼子上的第一個鹼基具有較彈性的配對能力
D. 指反編碼子上的第三個鹼基只能作Watson-Crick式的配對

正確答案：C. 指反編碼子上的第一個鹼基具有較彈性的配對能力